Un paciente acude al Hospital por un infarto de miocardio con elevacion del segmento ST. A su llegada está hipotenso, presenta crepitantes y se ausculta un soplo sistólico 3/6. ¿Cuál es su sospecha diagnóstica?
1. Shock cardiogénico.
2. Ruptura de pared libre de ventrículo izquierdo.
3. Insuficiencia mitral aguda por rotura de músculo papilar.
4. Taponamiento cardiaco.
5. Trombosis de tronco común.

Respuesta correcta: 3. Insuficiencia mitral aguda por rotura de músculo papilar.